下列有關進行性多灶性白質腦病（progressive multifocal leukoencephalopathy）的敘述，何者正確？
A. 常發生於白血病、惡性淋巴病及後天免疫缺乏症候群的患者
B. 病灶多見於腦幹及脊髓內
C. 病灶內的星細胞（astrocytes）皆呈萎縮狀況
D. 病灶內有明顯的炎性反應

正確答案：A. 常發生於白血病、惡性淋巴病及後天免疫缺乏症候群的患者